Subject has a documented or suspected metal sensitivity.

The above is a clinical trial inclusion criterion. Annotated with entity spans:
Subject has a [Mood: documented] or [Mood: suspected] [Device: metal] [Condition: sensitivity].